Clinical trial exclusion criterion:
a history of major head injury

Annotated entities:
- Condition: "major head injury"